¿Qué característica comparten la anorexia y la bulimia?:
1. Pérdida de control ante los hidratos de carbono.
2. Una preocupación extrema por el peso y la forma corporales.
3. Un IMC por debajo de 18.
4. La hostilidad hacia la madre.
5. La amenorrea.

Respuesta correcta: 2. Una preocupación extrema por el peso y la forma corporales.